下列有關視神經脊髓炎（neuromyelitis optica spectrum disorder, NMOSD）的敘述，何者正確？
A. 視神經脊髓炎對脊髓的侵犯範圍通常可以超過三節以上
B. 典型的視神經脊髓炎的臨床症狀包括：視神經炎、急性脊髓炎發作及周邊神經病變
C. 視神經脊髓炎的病人比起多發性硬化症的病人的預後要好，其視力和脊髓炎導致下肢無力的情況，均可恢復80%以上
D. 因為視神經脊髓炎病人的脊髓液，並不會出現蛋白質升高或是有oligoclonal band的現象，因此容易和多發性硬化症（multiple sclerosis）區分

正確答案：A. 視神經脊髓炎對脊髓的侵犯範圍通常可以超過三節以上